Clinical trial exclusion criterion:
Uncontrolled hypertension with systolic BP >160 mmHg or diastolic BP >95 mmHg.

Entity relations:
- Has_qualifier("hypertension", "Uncontrolled")
- Has_value("systolic BP", ">160 mmHg")
- Has_value("diastolic BP", ">95 mmHg")
- Subsumes("hypertension", "systolic BP")
- OR("systolic BP", "diastolic BP")